尿液中同香草酸（homovalinic acid）及香草扁桃酸（vanillylmandelic acid）量增加是下列何種兒童癌症之腫瘤標誌（tumor marker）？
A. 腎威爾姆氏腫瘤（Wilms' tumor）
B. 神經母細胞瘤（neuroblastoma）
C. 橫紋肌肉瘤（rhabdomyosarcoma）
D. 卵黃囊瘤（yolk sac tumor）

正確答案：B. 神經母細胞瘤（neuroblastoma）